Clinical trial exclusion criterion:
Known positive test(s) for human immunodeficiency virus infection (testing is not required in the absence of clinical suspicion).

Entity relations:
- Has_value("test(s) for human immunodeficiency virus infection", "positive")